Si un paciente afirma sin ser cierto, que estuvo en un hospital exactamente igual al que está ahora (o que ambos lugares existen paralelamente en distintos puntos espaciales), o que ya conocía a los enfermeros, se trata de:
1. Paramnesia reduplicativa.
2. Delirio de Sosias.
3. Agnosia de caras.
4. Síndrome del impostor.

Respuesta correcta: 1. Paramnesia reduplicativa.